Un hombre de 37 años presenta un cuadro de artritis de las metacarpofalángicas de ambas manos y una pleuritis derecha. En la exploración se aprecia eritema malar bilateral. Se detectan anticuerpos antinucleares positivos (titulo 1/640), con anticuerpos anti-DNA nativo también positivos; anti-Sm negativos. ¿Cuál sería el tratamiento inicial de elección de este paciente?
1. Glucocorticoides a altas dosis.
2. Glucocorticoides y micofenolato.
3. Antiinflamatorios no esteroideos y antipalúdicos.
4. El cuadro probablemente será autolimitado y no precisa tratamiento.

Respuesta correcta: 3. Antiinflamatorios no esteroideos y antipalúdicos.